Subject's parent or legal guardian gives informed consent and subject gives assent.

The above is a clinical trial inclusion criterion. Annotated with entity spans:
[Post-eligibility: Subject's parent or legal guardian gives informed consent and subject gives assent.]